endometrial thickness < 7 mm or no triple layer endometrium and/or functional follicles

The above is a clinical trial exclusion criterion. Annotated with entity spans:
[Measurement: endometrial thickness] [Value: < 7 mm] or [Negation: no] [Observation: triple layer endometrium] and/or [Observation: functional follicles]